Clinical trial exclusion criterion:
Ascites

Annotated entities:
- Condition: "Ascites"